Clinical trial exclusion criterion:
Active hepatic disease

Entity relations:
- Has_qualifier("hepatic disease", "Active")